Clinical trial inclusion criterion:
Subjects must be undergoing unilateral or bilateral mastectomy with tissue expander reconstruction

Entity relations:
- AND("mastectomy", "tissue expander reconstruction")
- Has_qualifier("mastectomy", "unilateral")
- Has_temporal("mastectomy", "undergoing")
- OR("unilateral", "bilateral")